La prosopagnosia se define como:
1. Forma extrema de agnosia caracterizada por la incapacidad para reconocer caras familiares.
2. Fracaso para reconocer los objetos por el tacto.
3. Pérdida de la capacidad para visualizar imágenes.
4. Forma de anosognosia en la cual el paciente niega su ceguera.
5. Experiencia perceptiva de un miembro amputado.

Respuesta correcta: 1. Forma extrema de agnosia caracterizada por la incapacidad para reconocer caras familiares.